A claimed prescription of a NOAC from a Danish pharmacy within 14 days of discharge or outpatient clinic visit.

The above is a clinical trial inclusion criterion. Annotated with entity spans:
A [Qualifier: claimed] [Procedure: prescription] of a [Drug: NOAC] from a [Qualifier: Danish pharmacy] [Temporal: within 14 days of discharge or outpatient clinic visit].